contra-indications for medical induction of labor

The above is a clinical trial exclusion criterion. Annotated with entity spans:
[Condition: contra-indications] for [Procedure: medical induction of labor]